Clinical trial inclusion criterion:
Documentation of the presence of an acute pulmonary exacerbation, based on CF Foundation guidelines, as diagnosed by a faculty member of the Denver Adult CF Program.

Entity relations:
- AND("acute pulmonary exacerbation", "CF Foundation guidelines")